下列何者絕大多數不屬於 B 細胞淋巴瘤？
A. 外套細胞淋巴瘤（mantle cell lymphoma）
B. 退行分化大細胞淋巴瘤（anaplastic large cell lymphoma）
C. 邊緣帶淋巴瘤（marginal zone lymphoma）
D. 伯基特氏淋巴瘤（Burkitt lymphoma）

正確答案：B. 退行分化大細胞淋巴瘤（anaplastic large cell lymphoma）